Clinical trial inclusion criterion:
Stable blood pressure regimen, stable lipid regimen, stable diabetes regimen and risk factor control for 6 weeks.

Entity relations:
- Has_qualifier("blood pressure regimen", "Stable")
- Has_qualifier("lipid regimen", "stable")
- Has_qualifier("diabetes regimen", "stable")
- Has_multiplier("blood pressure regimen", "for 6 weeks")
- Has_multiplier("lipid regimen", "for 6 weeks")
- Has_multiplier("diabetes regimen", "for 6 weeks")
- Has_multiplier("risk factor control", "for 6 weeks")